Clinical trial inclusion criterion:
Serum creatinine of < 1.5 ULN or calculated CrCl of > 50 mL/min

Annotated entities:
- Measurement: "Serum creatinine"
- Value: "< 1.5 ULN"
- Measurement: "calculated CrCl"
- Value: "> 50 mL/min"